What is the indication for zolmitriptan?

zolmitriptan is approved for migraine treatment.